Clinical trial exclusion criterion:
Subjects who are smokers or who have quit smoking <5 years ago

Annotated entities:
- Observation: "smokers"
- Observation: "quit smoking"
- Temporal: "<5 years ago"